Clinical trial exclusion criterion:
Active infectious endocarditis

Entity relations:
- Has_qualifier("infectious endocarditis", "Active")
- multi("Active", "Active")